Presence of any other disease with a life expectancy of <5 years.

The above is a clinical trial exclusion criterion. Annotated with entity spans:
Presence of [Qualifier: any other] [Condition: disease] with a [Observation: life expectancy] of [Value: <5 years].